Elective Female Pelvic Medicine and Reconstructive Surgery or Gynecologic Minimally Invasive surgeries including hysterectomy, suburethral sling, and pelvic organ prolapse repair that require cystoscopy.

The above is a clinical trial inclusion criterion. Annotated with entity spans:
[Qualifier: Elective] [Qualifier: Female Pelvic] [Drug: Medicine] and [Procedure: Reconstructive Surgery] or [Qualifier: Gynecologic] [Qualifier: Minimally Invasive] [Procedure: surgeries] including [Procedure: hysterectomy], [Procedure: suburethral sling], and [Procedure: pelvic organ prolapse repair] that [Mood: require] [Procedure: cystoscopy].